patients receiving home parenteral nutrition (HPN) because of short bowel syndrome for at least 12 months

The above is a clinical trial inclusion criterion. Annotated with entity spans:
patients receiving [Measurement: home parenteral nutrition (HPN)] because of [Condition: short bowel syndrome] [Temporal: for at least 12 months]